Clinical trial inclusion criterion:
Symptomatic primary knee osteoarthritis with failed conservative treatment at least 3 months

Annotated entities:
- Qualifier: "Symptomatic"
- Qualifier: "primary"
- Qualifier: "knee"
- Condition: "osteoarthritis"
- Procedure: "conservative treatment"
- Qualifier: "failed"
- Temporal: "at least 3 months"